Clinical trial exclusion criterion:
History of any reaction or hypersensitivity likely to be exacerbated by any component of the vaccines.

Entity relations:
- multi("likely to be exacerbated by any component of the vaccines", "component of the vaccines")
- Has_qualifier("reaction", "likely to be exacerbated by any component of the vaccines")
- OR("reaction", "hypersensitivity")